Clinical trial inclusion criteria:
use of basal-bolus insulin
onset of diabetes after age 30
BMI less than 35
eGFR at least 60 ml/mn
Hb A1c 7.0-10.0%
willingness to perform home glucose monitoring
willingness to transmit glucose and medication information weekly

Annotated entities:
- Drug: "basal-bolus insulin"
- Measurement: "onset of diabetes"
- Value: "after age 30"
- Measurement: "BMI"
- Value: "less than 35"
- Measurement: "eGFR"
- Value: "at least 60 ml/mn"
- Measurement: "Hb A1c"
- Value: "7.0-10.0%"
- Non-query-able: "willingness to perform home glucose monitoring"
- Non-query-able: "willingness to transmit glucose and medication information weekly"